正常情況下食道括約肌（lower esophageal sphincter）之相關敘述，下列何者正確？
A. 為縱狀肌之結構
B. 該處之腔內壓（intraluminal pressure）大於胃內壓
C. 距離胃食道連接處約 5 公分
D. 食物嚥下時，此處呈收縮狀態

正確答案：B. 該處之腔內壓（intraluminal pressure）大於胃內壓